Clinical trial inclusion criterion:
Age : from 20 to 90 y/o.

Entity relations:
- Has_value("Age", "20 to 90 y/o")